Leg ulcerations or infections in the foot.

The above is a clinical trial exclusion criterion. Annotated with entity spans:
[Condition: Leg ulcerations] or [Condition: infections in the foot].